 First group: allergic patients

The above is a clinical trial inclusion criterion. Annotated with entity spans:
 First group: [Condition: allergic] patients